Ongoing cord compression or a syrinx in the spinal cord or who suffer from a spinal cord disease such as spinal stenosis, spina bifida, MS, or herniated disk

The above is a clinical trial exclusion criterion. Annotated with entity spans:
Ongoing [Condition: cord compression] or a [Condition: syrinx] in the [Qualifier: spinal cord] or who suffer from a [Condition: spinal cord disease] such as [Condition: spinal stenosis], [Condition: spina bifida], [Condition: MS], or [Condition: herniated disk]